Lack of participation in another clinical study,

The above is a clinical trial inclusion criterion. Annotated with entity spans:
[Negation: Lack of] [Observation: participation in] [Qualifier: another] clinical study,